Hemoglobin > 12g/dL

The above is a clinical trial exclusion criterion. Annotated with entity spans:
[Measurement: Hemoglobin] [Value: > 12g/dL]